Clinical trial exclusion criterion:
Participation in any clinical investigation within 4 weeks prior to dosing or longer if required by local regulation.

Entity relations:
- Has_temporal("any clinical investigation", "within 4 weeks prior to dosing")
- Has_index("within 4 weeks prior to dosing", "dosing")